一位 21 歲女性，G3P2，妊娠 33 週，半夜急診就醫，主訴突然大量陰道出血，不覺疼痛，無任何內外科病史，曾剖腹生產兩次。下列何者為最可能的診斷？
A. 前置胎盤
B. 胎盤早期剝離
C. 子宮破裂
D. 子宮外孕

正確答案：A. 前置胎盤